Major organ transplantation.

The above is a clinical trial exclusion criterion. Annotated with entity spans:
[Procedure: Major organ transplantation].